下列何種情況可使吸入性麻醉劑的最小肺泡濃度（minimum alveolar concentration, MAC）減低？
A. 發燒
B. 慢性酗酒
C. 靜脈注射局部麻醉藥
D. 麻醉時間超過四小時

正確答案：C. 靜脈注射局部麻醉藥